下列何種藥物不屬於sedatives-hypnotics？
A. Diazepam
B. Lorazepam
C. Pentobarbital
D. Morphine

正確答案：D. Morphine